Clinical trial exclusion criterion:
3. Received donor lymphocyte infusion in last 28 days

Entity relations:
- Has_temporal("donor lymphocyte infusion", "in last 28 days")